Para detectar la aparición de una insuficiencia renal aguda prerrenal en un paciente, la enfermera deberá vigilar la presencia de:
1. Signos de bajo gasto cardíaco.
2. Hematuria.
3. Orina turbia y con mal olor.
4. Dolor cólico.
5. Elevación del aclaramiento de creatinina.

Respuesta correcta: 1. Signos de bajo gasto cardíaco.